Patients with bleeding disorders

The above is a clinical trial exclusion criterion. Annotated with entity spans:
Patients with [Condition: bleeding disorders]